Patients with liver cirrhosis, Hepatocellular Carcinoma or other malignancies.

The above is a clinical trial exclusion criterion. Annotated with entity spans:
Patients with [Condition: liver cirrhosis], [Condition: Hepatocellular Carcinoma] or other [Condition: malignancies].